下列何種基因的突變與ichthyosis vulgaris最有相關？
A. profilaggrin
B. steroid sulfatase
C. transglutaminase
D. keratin 1 or 10

正確答案：A. profilaggrin